有關人類乳突病毒（human papilloma virus, HPV）的敘述，下列何者最正確？
A. 有性經	的女性，約有20%曾被感染
B. 大部分被HPV感染的人都會產生生殖器官疣、子宮頸上皮病變及癌症
C. 高危險HPV有多型，其中最常引致子宮頸癌的是第16型
D. HPV疫苗可有效預防子宮頸癌，施打之後就不需要抹片檢查

正確答案：C. 高危險HPV有多型，其中最常引致子宮頸癌的是第16型